下列有關急性前骨髓細胞白血病的敘述，何者錯誤？
A. 大多數病人的白血病細胞內有染色體異常 t（15；17）
B. 大多數病人的白血病細胞內有異常的融合基因 AML 1/ETO
C. 病人常出現瀰漫性血管內凝血（DIC）
D. 最適當的誘導性治療為 tretinoin（all-trans retinoic acid）加 anthracycline 化學治療

正確答案：B. 大多數病人的白血病細胞內有異常的融合基因 AML 1/ETO